Clinical trial exclusion criterion:
Causes of PH other than that of heart failure, such as: chronic thromboembolic PH, sickle-cell disease, or sarcoidosis

Annotated entities:
- Condition: "Causes of PH"
- Negation: "other than"
- Condition: "heart failure"
- Condition: "chronic thromboembolic PH"
- Condition: "sickle-cell disease"
- Condition: "sarcoidosis"